Clinical trial exclusion criterion:
Treatment with warfarin

Entity relations:
- AND("Treatment", "warfarin")